Clinical trial exclusion criterion:
Pathologically altered level of any serum electrolyte (sodium, potassium, magnesium, calcium, chloride, phosphate) unless corrected prior to the start of study treatment

Annotated entities:
- Value: "Pathologically altered"
- Measurement: "level of any serum electrolyte"
- Measurement: "sodium"
- Measurement: "potassium"
- Measurement: "magnesium"
- Measurement: "calcium"
- Measurement: "chloride"
- Measurement: "phosphate"
- Non-representable: "unless corrected prior to the start of study treatment"